Contraindication to or planned discontinuation of dual antiplatelet therapy within 1 year

The above is a clinical trial exclusion criterion. Annotated with entity spans:
[Condition: Contraindication] to or [Mood: planned discontinuation] of [Procedure: dual antiplatelet therapy] [Temporal: within 1 year]